Completion of 6 weeks of physical therapy program

The above is a clinical trial inclusion criterion. Annotated with entity spans:
Completion of [Temporal: 6 weeks] of [Procedure: physical therapy program]